Newly-diagnosed gynecologic cancer patients in whom SLN mapping and surgical excision is indicated OR

The above is a clinical trial inclusion criterion. Annotated with entity spans:
Newly-diagnosed [Condition: gynecologic cancer] patients in whom [Procedure: SLN mapping] and [Condition: surgical excision is indicated] OR